1. Diagnosis of primary immunodeficiency with established plan to undergo myeloablative or non-myeloablative allogeneic hematopoietic stem cell transplant for treatment thereof or diagnosis of a form of primary immunodeficiency for which hematopoietic stem cell transplantation is not indicated.

The above is a clinical trial inclusion criterion. Annotated with entity spans:
[Parsing_Error: 1.] Diagnosis of [Condition: primary immunodeficiency] with established plan to undergo myeloablative or [Procedure: non-myeloablative allogeneic hematopoietic stem cell transplant] for treatment thereof or diagnosis of a form of [Condition: primary immunodeficiency] for which [Procedure: hematopoietic stem cell transplantation] is [Negation: not indicated].